¿Cuál de las siguientes se considera una respuesta normal del sistema cardiovascular originada en los barorreceptores como consecuencia de hipotensión?:
1. Aumento de la resistencia vascular sistémica.
2. Aumento de la estimulación parasimpática.
3. Disminución de la frecuencia cardíaca.
4. Disminución del volumen sistólico.
5. Disminución del gasto cardíaco.

Respuesta correcta: 1. Aumento de la resistencia vascular sistémica.